一個 20 歲的大學女生最近半年因為感情問題及課業壓力，經常在晚上一個人的時候，無法控制地吃下她原來食量兩倍多的食物，直到肚子脹到受不了才停止，但是她又很在意自己的身材和體重，所以又要想辦法減重。以下何者最不可能發生在這位女生？
A. 在白天時努力節食和運動
B. 大吃的時候，偏好甜食和高熱量的食物
C. 催吐後常會感到情緒低落
D. 催吐或使用瀉劑後出現血鉀濃度太高

正確答案：D. 催吐或使用瀉劑後出現血鉀濃度太高